Patients with psychiatric disorders that would interfere with consent or follow-up. Pregnant or lactating women. Men and women of reproductive potential may not participate unless they have agreed to use an effective contraceptive method.

The above is a clinical trial exclusion criterion. Annotated with entity spans:
Patients with [Condition: psychiatric disorders] that would [Qualifier: interfere with consent] or follow-up. [Condition: Pregnant] or [Condition: lactating] [Person: women]. Men and women of [Condition: reproductive potential] may not participate unless they have agreed to use an [Procedure: effective contraceptive method].